Clinical trial exclusion criterion:
Biliary strictures caused by malignancies other than pancreatic cancer, distal CBD cholangiocarcinoma and other periampullary cancers

Entity relations:
- Has_negation("pancreatic cancer", "other than")
- AND("malignancies", "pancreatic cancer")
- AND("Biliary strictures", "malignancies")
- OR("pancreatic cancer", "distal CBD cholangiocarcinoma", "other periampullary cancers")